Clinical trial exclusion criterion:
history of steroid cortisol administration

Annotated entities:
- Drug: "steroid cortisol"